Refusal to participate

The above is a clinical trial exclusion criterion. Annotated with entity spans:
[Non-query-able: Refusal to participate]